Clinical trial exclusion criteria:
Recent participation (within 28 days) in other research studies
Recent significant blood donation or plasma donation
Pregnant or lactating
Test positive at screening for human immunodeficiency virus (HIV), hepatitis B surface antigen (HbsAg), or hepatitis C virus (HCV)
Recent (2-year) history or evidence of alcoholism or drug abuse
History or presence of significant cardiovascular, pulmonary, hepatic, gallbladder or biliary tract, renal, hematologic, gastrointestinal, endocrine, immunologic, dermatologic, neurologic, or psychiatric disease
Subjects who have used any drugs or substances known to inhibit or induce cytochrome (CYP) P450 enzymes and/or P-glycoprotein (P-gp) within 28 days prior to the first dose and throughout the study
Drug allergies to quinine sulfate or rosiglitazone

Annotated entities:
- Temporal: "within 28 days"
- Context_Error: "Recent participation (within 28 days) in other research studies"
- Post-eligibility: "Recent participation (within 28 days) in other research studies"
- Procedure: "blood donation"
- Procedure: "plasma donation"
- Qualifier: "significant"
- Temporal: "Recent"
- Undefined_semantics: "significant"
- Condition: "Pregnant"
- Condition: "lactating"
- Value: "positive"
- Temporal: "at screening"
- Measurement: "human immunodeficiency virus (HIV)"
- Measurement: "hepatitis C virus (HCV)"
- Measurement: "hepatitis B surface antigen (HbsAg)"
- Condition: "alcoholism"
- Condition: "drug abuse"
- Temporal: "history"
- Mood: "evidence"
- Temporal: "Recent"
- Temporal: "2-year"
- Post-eligibility: "History or presence of significant cardiovascular, pulmonary, hepatic, gallbladder or biliary tract, renal, hematologic, gastrointestinal, endocrine, immunologic, dermatologic, neurologic, or psychiatric disease"
- Drug: "drugs known to inhibit cytochrome (CYP) P450 enzymes"
- Drug: "drugs known to induce cytochrome (CYP) P450 enzymes"
- Drug: "drugs known to inhibit P-glycoprotein (P-gp)"
- Drug: "drugs known to induce P-glycoprotein (P-gp)"
- Temporal: "within 28 days prior to the first dose"
- Temporal: "throughout the study"
- Condition: "allergies"
- Drug: "quinine sulfate"
- Drug: "rosiglitazone"